下列敘述，何者錯誤？
A. 齒齦阿米巴（Entamoeba gingivalis）的滋養體（trophozoites）會吞噬紅血球
B. 嗜碘阿米巴（Iodamoeba bütschlii）的滋養體具有一個很大的肝醣泡（glycogen vacuole）
C. 大腸纖毛蟲（Balantidium coli）是體型最大的人體寄生性原蟲
D. 大腸纖毛蟲（Balantidium coli）具有大核及小核

正確答案：B. 嗜碘阿米巴（Iodamoeba bütschlii）的滋養體具有一個很大的肝醣泡（glycogen vacuole）